Clinical trial exclusion criterion:
Active cancer

Entity relations:
- Has_qualifier("cancer", "Active")